上頜竇的開口位於：
A. 上鼻道
B. 中鼻道
C. 下鼻道
D. 鼻中隔

正確答案：B. 中鼻道